Clinical trial exclusion criterion:
on hemodialysis for less than 3 months

Annotated entities:
- Procedure: "hemodialysis"
- Temporal: "for less than 3 months"